Clinical trial inclusion criterion:
age <2 years

Entity relations:
- Has_value("age", "<2 years")